What is the name of the RNAi investigational drug being developed against hereditary amyloidosis?

Patisiran.